What eye disease(s) are associated with ocular toxoplasmosis?

the most frequent manifestation of congenital toxoplasmosis is retinochoroiditis.